=18 years old males

The above is a clinical trial inclusion criterion. Annotated with entity spans:
[Value: =18 years old] [Person: males]